下列何種介白質（Interleukin, IL）最適用於治療因化學療法引起之血小板過低症？
A. IL-3
B. IL-4
C. IL-11
D. IL-2

正確答案：C. IL-11